一位 27 歲男性因雙側男乳女性化（gynecomastia）求診，實驗室檢查發現肝功能正常，肝超音波亦正常，血中β-HCG 值異常增高，超音波發現右側睪丸有一 1.2 公分腫塊，此病患的下一步處置應為下列何者？
A. 經鼠蹊部（trans-inguinal）切除兩側睪丸
B. 經鼠蹊部切除右側睪丸
C. 經陰囊（trans-scrotum）切除右側睪丸
D. 經陰囊切除兩側睪丸

正確答案：B. 經鼠蹊部切除右側睪丸